2. Screening tool: TMS adult safety screening, Medical History.

The above is a clinical trial exclusion criterion. Annotated with entity spans:
[Parsing_Error: 2.] [Procedure: Screening] tool: [Procedure: TMS adult safety screening], [Temporal: Medical History].